Known to be sero-positive for human immunodeficiency virus (HIV), hepatitis C virus (HCV), or hepatitis B virus (HBV)

The above is a clinical trial exclusion criterion. Annotated with entity spans:
Known to be [Condition: sero-positive for human immunodeficiency virus (HIV)], [Measurement: hepatitis C virus (HCV)], or [Measurement: hepatitis B virus (HBV)]